Present therapy with systemic steroids

The above is a clinical trial exclusion criterion. Annotated with entity spans:
[Temporal: Present] [Procedure: therapy] with [Drug: systemic steroids]